生過3個小孩的26歲婦女在懷孕28週時發生自發性流產，其流產生出的男嬰比一般正常週數的胎兒要小，而且兩手的第三指和第四指有連在一起的畸形。胎盤除了比較小之外，還可以看到一些大小約0.8公分像葡萄狀的水泡。則這些胎盤組織最可能有下列那種染色體異常？
A. 69,XXY
B. 46,XX
C. 23,Y
D. 47,XXY

正確答案：A. 69,XXY